Subjects must have failed at least two previous chemotherapy regimens. Paclitaxel must have been a component of one or both regimens and cisplatin or carboplatin must have been a component of one or both regimens.

The above is a clinical trial inclusion criterion. Annotated with entity spans:
Subjects must have [Observation: failed] [Multiplier: at least two] [Temporal: previous] [Procedure: chemotherapy regimens]. [Drug: Paclitaxel] must have been a component of one or both regimens and [Drug: cisplatin] or [Drug: carboplatin] must have been a component of one or both regimens.